Clinical trial exclusion criterion:
Presence of a significant medical or psychiatric condition (Examples include: Diagnosis and treatment of tuberculosis (TB) or HIV; renal insufficiency; hepatic disease; oral or parenteral medication known to affect the immune function, such as corticosteroids, other immunosuppressant drugs; or behavioural or memory issues)

Entity relations:
- Has_qualifier("medical condition", "significant")
- AND("treatment", "tuberculosis (TB)")
- Has_qualifier("oral medication", "known to affect the immune function")
- Has_qualifier("immunosuppressant drugs", "other")
- Subsumes("oral medication", "corticosteroids")
- Subsumes("medical condition", "treatment")
- OR("medical condition", "psychiatric condition")
- OR("treatment", "HIV", "renal insufficiency", "hepatic disease", "oral medication", "tuberculosis (TB)")
- OR("oral medication", "parenteral medication")
- OR("behavioural issues", "memory issues")
- OR("corticosteroids", "behavioural issues", "immunosuppressant drugs")